Diagnosed with an infection related stone.

The above is a clinical trial inclusion criterion. Annotated with entity spans:
Diagnosed with an [Qualifier: infection related] [Condition: stone].